一位 60 歲病人有糖尿病及高血壓，偶爾發生胸悶及呼吸困難，其休息時心電圖（resting ECG）無明顯異常。病人自述仍能從事快走運動。當你懷疑此病人可能有缺血性心臟病時，應優先安排何種檢查？
A. 跑步機運動心電圖檢查（Treadmill exercise test）
B. 心臟超音波檢查
C. 核子灌注掃描（Nuclear perfusion scan）
D. 心臟磁振掃描

正確答案：A. 跑步機運動心電圖檢查（Treadmill exercise test）